On systemic antibiotics or with an active bacterial infection at the time of surgery

The above is a clinical trial exclusion criterion. Annotated with entity spans:
On [Drug: systemic antibiotics] or with an [Qualifier: active] [Condition: bacterial infection] [Temporal: at the time of surgery]